Clinical trial inclusion criterion:
Patients with a clinical diagnosis of depression who in the judgement of their physician require medication management may be eligible for enrollment. A score of 10 or more on the PHQ-9 instrument will be required for enrollment.

Annotated entities:
- Condition: "depression"
- Drug: "medication"
- Measurement: "PHQ-9"
- Value: "score of 10 or more"